¿Cuál de las siguientes bacterias puede ser una causa de fiebres reumáticas?
1. Nocardia brasiliensis
2. Streptococcus pyogenes.
3. Staphylococcus epidermidis.
4. Enterococcus faecium.

Respuesta correcta: 2. Streptococcus pyogenes.